下列有關尿液濃縮的敘述，何者錯誤？
A. 尿素在腎臟髓質組織間液的濃度會影響腎臟髓質垂直性滲透壓梯度
B. 抗利尿激素（antidiuretic hormone）可以促進集尿管的尿素轉運蛋白（urea transpoter; UT）再吸收管內液  中的尿素
C. 尿素可經由尿素轉運蛋白（urea transpoter; UT）UT-A1與UT-A3促進尿液濃縮
D. 低蛋白飲食會增加腎臟尿液濃縮的能力

正確答案：D. 低蛋白飲食會增加腎臟尿液濃縮的能力